Clinical trial exclusion criterion:
Have a 10 yr probability of hip fracture >3% or major fracture >20% based on results of the FRAX tool

Entity relations:
- Has_value("10 yr probability of hip fracture", ">3%")
- Has_value("10 yr probability of major fracture", ">20%")